Not treated already with antimicrobial medications at presentation

The above is a clinical trial inclusion criterion. Annotated with entity spans:
Not treated already with [Drug: antimicrobial medications] at presentation